Clinical trial exclusion criterion:
Drug-induced hypotension, if necessary, evaluate patient after discontinuing the causative drug for one month

Annotated entities:
- Qualifier: "Drug-induced"
- Condition: "hypotension"
- Non-representable: "if necessary, evaluate patient after discontinuing the causative drug for one month"